薦髓傷害（sacral spinal cord injury）常發生的尿動力檢查異常是：
A. 逼尿肌過度反射（detrusor hyperreflexia）
B. 逼尿肌無反射（detrusor areflexia）
C. 逼尿肌尿道外括約肌共濟失調（detrusor- external sphincter dyssynergia）
D. 低順應性（low compliance）

正確答案：B. 逼尿肌無反射（detrusor areflexia）